Abnormal renal function

The above is a clinical trial exclusion criterion. Annotated with entity spans:
[Condition: Abnormal renal function]